Inability to lie flat for 20-30 minutes (the anticipated amount of time to complete the MRI procedure)

The above is a clinical trial exclusion criterion. Annotated with entity spans:
[Condition: Inability to lie flat] for [Qualifier: 20-30 minutes] (the anticipated [Qualifier: amount of time to complete the MRI procedure])